Clinical trial exclusion criterion:
Human Immunodeficiency Virus (HIV)

Annotated entities:
- Condition: "Human Immunodeficiency Virus (HIV)"